Clinical trial inclusion criterion:
ECOG performance status of 0-2

Entity relations:
- Has_value("ECOG performance status", "0-2")